Clinical trial exclusion criterion:
Medullary thyroid carcinoma (MTC) or Multiple Endocrine Neoplasia Syndrome Type 2 (MEN 2)

Annotated entities:
- Condition: "Medullary thyroid carcinoma"
- Condition: "MTC"
- Condition: "Multiple Endocrine Neoplasia Syndrome Type 2"
- Condition: "MEN 2"